Clinical trial exclusion criterion:
Baseline cognitive deficits sufficient to make objective pain self-assessments unreliable in the estimation of the Study Investigators.

Annotated entities:
- Post-eligibility: "Baseline cognitive deficits sufficient to make objective pain self-assessments unreliable in the estimation of the Study Investigators."